Clinical trial inclusion criterion:
aged 3-9 years

Entity relations:
- Has_value("aged", "3-9 years")